Al conjunto de mecanismos sociales cuya función es la transformación de productos especializados en forma de servicios sanitarios para la sociedad, se le denomina sistema:
1. Sanitario.
2. Social.
3. Seguros sociales.
4. Liberal.
5. De mercado.

Respuesta correcta: 1. Sanitario.